Clinical trial inclusion criterion:
ASA physical status I-III;

Entity relations:
- Has_value("ASA physical status", "I-III")